下列有關肝臟良性腫瘤的敘述，何者錯誤？
A. 局部結節增生（focal nodular hyperplasia）是第二常見的肝臟良性腫瘤
B. 腺瘤（adenoma）與長期口服避孕藥有相關
C. 相較於腺瘤，局部結節增生較易破裂出血
D. 大部分血管瘤（hemangioma）都是無症狀，而且女性居多

正確答案：C. 相較於腺瘤，局部結節增生較易破裂出血